周醫師在幫病患王老先生進行胃鏡檢查時，發現王老先生胃部有一處胃潰瘍，周醫師初步判斷應該屬於良性潰瘍而沒有幫王老先生進行切片檢查。胃鏡檢查結束，王老先生很擔心該胃潰瘍會不會是胃癌，而多次詢問周醫師是否應該馬上再次做胃鏡配合切片檢查，周醫師告知只要吃藥4個月胃潰瘍就可以痊癒。4個月後，王先生再度接受胃鏡檢查，切片檢查顯示為胃癌。周醫師為了避免醫療糾紛，在第一次胃鏡報告上增加「病患想先吃藥」的敘述。下列敘述何者正確？
A. 可以有效避免醫療糾紛
B. 屬於醫療糾紛發生後必要的病歷補登行為
C. 雖然在倫理上有可議之處，在法律上卻是完全合法
D. 不只在倫理上有可議之處，在法律上也是違法的行為

正確答案：D. 不只在倫理上有可議之處，在法律上也是違法的行為